Clinical trial exclusion criterion:
History of intolerance to ARB or amlodipine.

Annotated entities:
- Condition: "intolerance"
- Drug: "ARB"
- Drug: "amlodipine"